Unstable angina pectoris as judged by the investigator, clinically significant uncorrected valvular disease or left ventricular outflow obstruction, obstructive cardiomyopathy, poorly controlled fast atrial fibrillation or flutter, poorly controlled symptomatic brady- or tachyarrhythmias.

The above is a clinical trial exclusion criterion. Annotated with entity spans:
[Condition: Unstable angina pectoris] as judged by the investigator, [Qualifier: clinically significant] uncorrected [Condition: valvular disease] or [Condition: left ventricular outflow obstruction], [Condition: obstructive cardiomyopathy], [Qualifier: poorly controlled] [Condition: fast atrial fibrillation] or flutter, [Qualifier: poorly controlled] [Qualifier: symptomatic] [Condition: brady-] or [Condition: tachyarrhythmias].